(7)Patients currently taking folate, B12, or B6, or any compounds containing them, who express an inability or a refusal to stop usage;

The above is a clinical trial exclusion criterion. Annotated with entity spans:
(7)Patients [Temporal: currently] taking [Drug: folate], [Drug: B12], or [Drug: B6], or any compounds containing them, who express an [Observation: inability] or a [Observation: refusal to stop usage];